Respiratory Depression

The above is a clinical trial exclusion criterion. Annotated with entity spans:
[Condition: Respiratory Depression]